Clinical trial exclusion criteria:
Can not cooperate with the treatment
Can not obtain the child's parental consent

Annotated entities:
- Observation: "cooperate with the treatment"
- Negation: "not"
- Negation: "not"
- Observation: "child's parental consent"
- Informed_consent: "Can not obtain the child's parental consent"